下列何者不是構成知情同意（informed consent）的要素？
A. 隱私（privacy）
B. 告知（disclosure）
C. 決定能力（capacity）
D. 自願（voluntariness）

正確答案：A. 隱私（privacy）